Clinical trial inclusion criterion:
Referred for surgery for open reduction and internal fixation for ankle fracture

Entity relations:
- AND("open reduction and internal fixation", "ankle fracture")
- AND("surgery", "open reduction and internal fixation")